¿Cuál de los fármacos reseñados produce taquicardia y palpitaciones como efectos adversos?:
1. Atenolol.
2. Lidocaína.
3. Metamizol.
4. Salbutamol.

Respuesta correcta: 4. Salbutamol.